如何避免手術後殘存的神經肌肉阻斷作用（neuromuscular blockade）？
A. 儘量使用長效型的肌肉鬆弛劑（muscle relaxants），以避免手術中重複追加肌肉鬆弛劑，導致劑量累積以及術後的神經肌肉阻斷殘存作用
B. 手術麻醉期間儘量將所有四連刺激（train of four, TOF）所引發的肌肉抽動都阻斷（total twitch
C. 術後要以擷抗劑（antagonists）進行阻斷作用的反轉（reversal），但是擷抗劑的投予，必須在四連刺激至少有兩個以上的肌肉抽動以後才可給藥
D. 臨床人員必須謹記，唯有四連刺激監測的結果，沒有明顯的消退作用（fade），才能保證不會發生明顯的手術後神經肌肉阻斷殘存作用

正確答案：C. 術後要以擷抗劑（antagonists）進行阻斷作用的反轉（reversal），但是擷抗劑的投予，必須在四連刺激至少有兩個以上的肌肉抽動以後才可給藥